Clinical trial exclusion criterion:
Pregnant or breast-feeding women.

Entity relations:
- OR("Pregnant", "breast-feeding")